Clinical trial exclusion criterion:
Treated with anakinra, abatacept, or tocilizumab in the last 6 months

Annotated entities:
- Drug: "anakinra"
- Drug: "abatacept"
- Drug: "tocilizumab"
- Temporal: "in the last 6 months"